鼻淚管通往鼻腔的開口位於何處？
A. 上鼻道（superior meatus）
B. 中鼻道（middle meatus）
C. 下鼻道（inferior meatus）
D. 蝶篩隱窩（sphenoethmoidal recess）

正確答案：C. 下鼻道（inferior meatus）